Patient has to voluntarily join the study and sign the Informed Consent Form for the study;

The above is a clinical trial inclusion criterion. Annotated with entity spans:
[Informed_consent: Patient has to voluntarily join the study and sign the Informed Consent Form for the study;]